High bleeding risk or spontaneously prolonged prothrombin time or activated partial thromboplastin time > 1.5 x ULN

The above is a clinical trial exclusion criterion. Annotated with entity spans:
[Condition: High bleeding risk] or [Qualifier: spontaneously] [Condition: prolonged prothrombin time] or [Measurement: activated partial thromboplastin time] [Value: > 1.5 x ULN]